Clinical trial inclusion criterion:
An ECOG PS score of between 0 and 1;

Annotated entities:
- Measurement: "ECOG PS"
- Value: "between 0 and 1"